Clinical trial inclusion criterion:
active bleeding, clinical findings, that in the judgement of the investigator are associated with an increased risk of bleeding

Annotated entities:
- Condition: "bleeding"
- Temporal: "active"
- Condition: "clinical findings, that in the judgement of the investigator are associated with an increased risk of bleeding"